¿A qué grupo de clasificación biofarmacéutica pertenece el metoprolol si la dosis (100 mg) se disuelve en un volumen acuoso de 0,1 ml y presenta una fracción oral absorbida cercana al 90%?:
1. Clase IV.
2. Clase III.
3. Clase II.
4. Clase I.

Respuesta correcta: 4. Clase I.